croup children between 6 month and 5 years old

The above is a clinical trial inclusion criterion. Annotated with entity spans:
croup [Person: children] [Value: between 6 month and 5 years] [Person: old]